Clinical trial exclusion criterion:
Electrolyte imbalance (hypocalcaemia, hyponatremia and hypoglycemia)

Entity relations:
- Subsumes("Electrolyte imbalance", "hypocalcaemia")
- OR("hypocalcaemia", "hypoglycemia", "hyponatremia")